30歲少婦，婚後6年來並無節育計畫，但未曾懷孕，月經時有時無，突然出現頭痛、視力模糊且看東西有黑影，身體檢查發現眼球活動正常，但視野有兩顳側半盲，根據上述發現最有可能的診斷為何？
A. 顱咽瘤（craniopharyngioma）
B. 腦下垂體腦瘤出血（pituitary apoplexy）
C. 矢狀竇旁腦膜瘤（parasagittal meningioma）
D. 聽神經瘤（acoustic neuroma）

正確答案：B. 腦下垂體腦瘤出血（pituitary apoplexy）